有關單側或雙側聲帶麻痺（vocal fold paralysis）之敘述，下列何者正確？
A. 造成聲帶麻痺之主因為上喉神經（superior laryngeal nerve）受損
B. 呼吸困難較常見於單側聲帶麻痺
C. 單側聲帶麻痺以左側較為常見
D. 發聲障礙較常見於雙側聲帶麻痺

正確答案：C. 單側聲帶麻痺以左側較為常見